Clinical trial exclusion criterion:
Positive HIV in the screening examination of history of any immunosuppressant disease;

Entity relations:
- Has_value("HIV", "Positive")
- Has_temporal("HIV", "in the screening examination")
- Has_index("in the screening examination", "screening examination")
- OR("HIV", "immunosuppressant disease")